Una molécula de bajo peso molecular no inmunogénica, que sí lo es cuando se acopla a una proteína portadora antigénica es un:
1. Glicoconjugado.
2. Paratopo.
3. Isotipo.
4. Epítopo.
5. Hapteno.

Respuesta correcta: 5. Hapteno.